Patients with a supratheraputic (>3.0) INR

The above is a clinical trial exclusion criterion. Annotated with entity spans:
Patients with a [Value: supratheraputic] ([Value: >3.0]) [Measurement: INR]